Clinical trial exclusion criterion:
Abnormal serum glucose levels either at fasting or after the 2-hr oral glucose tolerance test meeting criteria for the diagnosis of diabetes mellitus according to the American Diabetes Association.

Entity relations:
- Has_value("serum glucose levels", "Abnormal")
- Has_temporal("Abnormal serum glucose levels", "at fasting")
- Has_value("criteria for the diagnosis of diabetes mellitus according to the American Diabetes Association", "meeting")
- Has_qualifier("Abnormal serum glucose levels", "meeting criteria for the diagnosis of diabetes mellitus according to the American Diabetes Association")
- Has_index("after the 2-hr oral glucose tolerance test", "the 2-hr oral glucose tolerance test")
- Has_index("at fasting", "fasting")
- AND("Abnormal serum glucose levels", "2-hr oral glucose tolerance test")
- OR("at fasting", "after the 2-hr oral glucose tolerance test")